Clinical trial inclusion criteria:
age 18 years or older
patients undergoing invasive procedures via the radial or femoral arteries

Annotated entities:
- Person: "age"
- Value: "18 years or older"
- Procedure: "invasive procedures"
- Temporal: "undergoing"
- Qualifier: "radial arteries"
- Qualifier: "femoral arteries"